Clinical trial inclusion criterion:
All patients must have diagnostic laparoscopy with diagnostic washings for cytology; both cytology positive and negative patients are eligible for enrolment, but only cytology negative patients will be included in the primary analyses; gross peritoneal disease is not eligible

Entity relations:
- Has_qualifier("laparoscopy", "diagnostic")
- Has_value("cytology", "positive")
- OR("positive", "negative")